Physical examination at screening period without clinically significant changes;

The above is a clinical trial inclusion criterion. Annotated with entity spans:
[Undefined_semantics: Physical examination at screening period without clinically significant changes;]